Clinical trial exclusion criteria:
Risk of severe alcohol withdrawal (e.g. history of seizures or delirium tremens)
Current Moderate or Severe Substance Use Disorder, other than Alcohol, Nicotine or Caffeine Use Disorders
Lifetime history of Bipolar Disorder, Schizophrenia or Schizoaffective Disorder
Any current psychiatric disorder, other than Alcohol Use Disorder, that, in the judgment of the investigator, will require treatment that will interfere with study participation.
Current severe depression (HAM-D >24) or anxiety (HAM-A >24)
Significant suicide or violence risk
Currently taking any psychotropic medications
Legally mandated to participate in treatment
History of prior treatment with disulfiram
Sufficiently socially unstable as to preclude participation (e.g. homeless)
Contraindications to disulfiram treatment (liver disease, kidney disease, cardiac disease, seizure disorder, hypothyroidism, diabetes mellitus, pregnancy or lactation, allergy to disulfiram or thiuran derivatives)
Neurological or medical conditions that would interfere with MRI scanning (e.g. history of stroke, seizure, brain tumor, brain infection, traumatic brain injury, multiple sclerosis, dementia, metal device in body, pregnancy, claustrophobia, color blindness, severe hearing impairment, weight>300 lbs., wheelchair-bound)
Currently taking medications containing alcohol, metronidazole, isoniazid, paraldehyde, phenytoin, warfarin, or theophylline.
Significant alcohol withdrawal (CIWA>8) at screening, after confirming a blood alcohol level of zero.

Annotated entities:
- Qualifier: "severe"
- Condition: "alcohol withdrawal"
- Mood: "Risk of"
- Condition: "seizures"
- Temporal: "history"
- Condition: "delirium tremens"
- Condition: "Substance Use Disorder"
- Qualifier: "Moderate"
- Qualifier: "Severe"
- Temporal: "Current"
- Negation: "other than"
- Condition: "Alcohol Use Disorders"
- Condition: "Nicotine Use Disorders"
- Condition: "Caffeine Use Disorders"
- Condition: "Bipolar Disorder"
- Temporal: "Lifetime history"
- Condition: "Schizophrenia"
- Condition: "Schizoaffective Disorder"
- Condition: "psychiatric disorder"
- Temporal: "current"
- Condition: "Alcohol Use Disorder"
- Non-representable: "that, in the judgment of the investigator, will require treatment that will interfere with study participation."
- Negation: "other than"
- Temporal: "Current"
- Qualifier: "severe"
- Condition: "depression"
- Measurement: "HAM-D"
- Value: ">24"
- Condition: "anxiety"
- Measurement: "HAM-A"
- Value: ">24"
- Qualifier: "severe"
- Condition: "suicide risk"
- Condition: "violence risk"
- Qualifier: "Significant"
- Drug: "psychotropic medications"
- Temporal: "Currently"
- Non-query-able: "Legally mandated to participate in treatment"
- Drug: "disulfiram"
- Temporal: "History of prior treatment"
- Condition: "socially unstable"
- Qualifier: "Sufficiently"
- Condition: "Contraindications"
- Drug: "disulfiram"
- Condition: "liver disease"
- Condition: "kidney disease"
- Condition: "cardiac disease"
- Condition: "seizure disorder"
- Condition: "hypothyroidism"
- Condition: "diabetes mellitus"
- Condition: "pregnancy"
- Condition: "lactation"
- Condition: "allergy"
- Drug: "disulfiram"
- Drug: "thiuran derivatives"
- Condition: "medical conditions"
- Condition: "conditions Neurological"
- Condition: "interfere"
- Procedure: "MRI scanning"
- Condition: "stroke"
- Condition: "seizure"
- Condition: "brain tumor"
- Condition: "brain infection"
- Condition: "traumatic brain injury"
- Condition: "multiple sclerosis"
- Condition: "dementia"
- Device: "metal device in body"
- Condition: "pregnancy"
- Condition: "claustrophobia"
- Condition: "color blindness"
- Condition: "hearing impairment"
- Qualifier: "severe"
- Measurement: "weight"
- Value: ">300 lbs."
- Condition: "wheelchair-bound"
- Drug: "alcohol"
- Drug: "metronidazole"
- Drug: "isoniazid"
- Drug: "paraldehyde"
- Drug: "phenytoin"
- Drug: "warfarin"
- Drug: "theophylline"
- Temporal: "Currently"
- Qualifier: "Significant"
- Condition: "alcohol withdrawal"
- Measurement: "CIWA"
- Value: ">8"
- Temporal: "at screening"
- Measurement: "blood alcohol level"
- Value: "zero"